Clinical trial inclusion criterion:
Life expectancy of > 3 months

Entity relations:
- Has_value("Life expectancy", "> 3 months")